Helicobacter infected patients who have not been treated for eradication (recruitment if negative in re-examination after treatment).

The above is a clinical trial exclusion criterion. Annotated with entity spans:
[Condition: Helicobacter infected] patients who have [Negation: not] been [Procedure: treated for eradication] (recruitment if negative in re-examination after treatment).